Clinical trial exclusion criterion:
inflammatory or chronic disorder

Entity relations:
- OR("chronic disorder", "disorder inflammatory")